Caucasian patients affected by uncomplicated, essential hypertension, not well controlled by concomitant administration of ACE-I or ARBs and diuretics at the maximum dosage.

The above is a clinical trial inclusion criterion. Annotated with entity spans:
[Person: Caucasian] patients affected by [Qualifier: uncomplicated], [Condition: essential hypertension], [Qualifier: not well controlled] by concomitant administration of [Drug: ACE-I] or [Drug: ARBs] and [Drug: diuretics] at the [Multiplier: maximum dosage].